Clinical trial inclusion criterion:
a high cardiovascular risk and LDL-cholesterol> 2.5 mmol / l

Entity relations:
- Has_value("LDL-cholesterol", "> 2.5 mmol / l")
- Has_qualifier("cardiovascular risk", "high")
- AND("cardiovascular risk", "LDL-cholesterol")